Un átomo de carbono aislado es:
1. Diamagnético.
2. Ferromagnético.
3. Paramagnético, con un electrón desapareado.
4. Paramagnético, con dos electrones desapareados.
5. Paramagnético, con tres electrones desapareados.

Respuesta correcta: 4. Paramagnético, con dos electrones desapareados.